Planned gynecological lower abdomen surgery with epidural pain treatment

The above is a clinical trial inclusion criterion. Annotated with entity spans:
[Mood: Planned] [Procedure: gynecological lower abdomen surgery] with [Procedure: epidural pain treatment]